En nuestra entrevista con una adolescente de 14 años y su familia se recogen los datos que figuran a continuación: ha cambiado su carácter, manifestándose triste e irritable; preocupación excesiva por lo que come; obsesión por el gimnasio y estancamiento o disminución de su peso corporal, aunque ha aumentado su talla. La adolescente no reconoce ninguna de estas observaciones alegando que está creciendo. Pensaríamos que:
1. Aunque pudiera corresponder a criterios de diagnóstico de un trastorno alimentario, los signos y los síntomas por si solos no son suficientes y en ocasiones estigmatizan a los jóvenes produciéndoles sufrimiento.
2. Estos datos se corresponden por si solos con los criterios de diagnóstico de la Anorexia según el DSM-IV.
3. Estos datos se corresponden por si solos con los criterios de diagnóstico de Bulimia Nerviosa según el DSM-IV.
4. Estos datos son poco relevantes para establecer un diagnóstico, por lo que le quitará importancia.
5. Todas las respuestas son correctas.

Respuesta correcta: 1. Aunque pudiera corresponder a criterios de diagnóstico de un trastorno alimentario, los signos y los síntomas por si solos no son suficientes y en ocasiones estigmatizan a los jóvenes produciéndoles sufrimiento.